Clinical trial inclusion criterion:
Patients with a diagnosis of prostatic carcinoma requiring prostate surgery

Annotated entities:
- Condition: "prostatic carcinoma"
- Procedure: "prostate surgery"